7. Unable to wean steroids to ≤0.5 mg/kg/day prednisone.

The above is a clinical trial exclusion criterion. Annotated with entity spans:
[Parsing_Error: 7.] [Negation: Unable] to [Procedure: wean] [Drug: steroids] to [Value: ≤0.5 mg/kg/day] [Drug: prednisone].